Clinical trial inclusion criterion:
Hematologic function, as follows: Absolute neutrophil count (ANC) >=1.5 x 10^9/Liter (L), Platelet count >=75 x 10^9/L, Hemoglobin >=8.0 gram/deciliter (g/dL).

Entity relations:
- Has_value("Absolute neutrophil count (ANC)", ">=1.5 x 10^9/Liter (L)")
- Has_value("Platelet count", ">=75 x 10^9/L")
- Has_value("Hemoglobin", ">=8.0 gram/deciliter (g/dL)")
- OR("Absolute neutrophil count (ANC)", "Platelet count", "Hemoglobin")